關於幽門螺旋桿菌（Helicobacter pylori）的敘述，下列何者錯誤？
A. 人類為其主要的貯存宿主（reservoir），糞口途徑（fecal-oral route）為可能的傳染方式
B. 此菌可能會導致胃潰瘍（gastric ulcer）或十二指腸潰瘍（duodenal ulcer）
C. cagA（cytotoxin-associated gene A）陽性細菌的感染被認為與導致胃癌的高風險有關
D. 尿素呼氣試	（urea breath test）是一種非侵入性的檢	方法，但其敏感度與專一性都比傳統細菌培養差

正確答案：D. 尿素呼氣試	（urea breath test）是一種非侵入性的檢	方法，但其敏感度與專一性都比傳統細菌培養差